在哺乳類動物利用膽鹼（choline）合成磷脂醯絲胺酸（phosphatidylserine）的過程中，需要下列何者？
A. GTP
B. CTP
C. AMP
D. UMP

正確答案：B. CTP